Clinical trial inclusion criterion:
the last vaccination intervals = 14 days

Annotated entities:
- Observation: "last vaccination intervals"
- Value: "= 14 days"